Clinical trial exclusion criteria:
Patients that do not have a valid Ontario Health Insurance Plan (OHIP) number at time of first transfusion
Patients that require emergent release of a RBC transfusion and in whom emergency randomization could not be completed
Patients with complex antibody profile in which it is impossible to match RBC units

Annotated entities:
- Mood: "have a valid Ontario Health Insurance Plan (OHIP) number"
- Negation: "not"
- Temporal: "at time of first transfusion"
- Reference_point: "first transfusion"
- Procedure: "transfusion"
- Multiplier: "first"
- Procedure: "RBC transfusion"
- Procedure: "emergency randomization"
- Qualifier: "emergent release"
- Mood: "require"
- Negation: "could not be completed"
- Condition: "complex antibody profile"
- Observation: "impossible to match RBC units"